Clinical trial exclusion criterion:
Known intolerance to tramadol or other contraindications for the drug

Entity relations:
- AND("contraindications", "the drug")
- AND("intolerance", "tramadol")
- AND("intolerance", "contraindications")
- Has_qualifier("contraindications", "other")